下列有關白血病及髓異生症候群（myelodysplastic syndrome）之敘述，何者錯誤？
A. 絕大部分之慢性髓性白血病（chronic myeloid leukemia, CML）均可偵測到費城染色體（Philadelphia
B. 急性白血病（acute leukemia）之分生變化單純是因為幹細胞之單株性增生外，多涉及分化障礙
C. CML 是一種髓性幹細胞之單株性增生
D. 髓異生症候群是一種前白血病，一定會發展成白血病

正確答案：D. 髓異生症候群是一種前白血病，一定會發展成白血病